La liberación de los rotavirus una vez finalizado su ciclo reproductivo en la célula huésped tiene lugar por:
1. Gemación.
2. Lisis celular.
3. Exocitosis.
4. Puentes intercelulares.

Respuesta correcta: 2. Lisis celular.